History of any malignancy or other severe diseases

The above is a clinical trial exclusion criterion. Annotated with entity spans:
History of any [Condition: malignancy] or other [Condition: severe diseases]